Clinical trial exclusion criterion:
End stage liver disease, defined as acute or chronic liver disease and recent history of one of the following: ascites, encephalopathy, variceal bleeding, bilirubin equal or greater than 2.0 mg/dL, albumin equal or less than 3.5 g/ dL, prothrombin time greater or equal to 4 seconds, INR greater than or equal to 1.7 or prior liver transplant

Annotated entities:
- Condition: "End stage liver disease"
- Condition: "chronic liver disease"
- Condition: "acute liver disease"
- Temporal: "recent"
- Condition: "ascites"
- Condition: "encephalopathy"
- Condition: "variceal bleeding"
- Measurement: "bilirubin"
- Value: "equal or greater than 2.0 mg/dL"
- Measurement: "albumin"
- Value: "equal or less than 3.5 g/ dL"
- Measurement: "prothrombin time"
- Value: "greater or equal to 4 seconds"
- Measurement: "INR"
- Value: "greater than or equal to 1.7"
- Temporal: "prior"
- Procedure: "liver transplant"